Clinical trial exclusion criterion:
the abnormality of 4 levels (local, systemic adverse reactions and vital signs) was judged to be related to vaccination

Annotated entities:
- Non-representable: "the abnormality of 4 levels (local, systemic adverse reactions and vital signs) was judged to be related to vaccination"